Clinical trial exclusion criterion:
History of allergy or hypersensitivity to Sugammadex and/or atropine or Neostigmine

Annotated entities:
- Condition: "allergy"
- Condition: "hypersensitivity"
- Drug: "Sugammadex"
- Drug: "atropine"
- Drug: "Neostigmine"
- Temporal: "History"